IgA Deficiency

The above is a clinical trial exclusion criterion. Annotated with entity spans:
[Condition: IgA Deficiency]